依據社會再適應評估表（social readjustment rating scale），下列何種生活事件所造成的壓力強度最大？
A. 配偶死亡
B. 離婚
C. 入獄
D. 子女死亡

正確答案：A. 配偶死亡